Pregnancy or planning to become pregnant

The above is a clinical trial exclusion criterion. Annotated with entity spans:
[Condition: Pregnancy] or [Mood: planning to become] [Condition: pregnant]